Según la Escala de Trastornos del Pensamiento, el Lenguaje y la Comunicación (Andreasen, 1979), cual es la definición de Habla Distraída:
1. Respuestas de una duración mayor de lo adecuado y que proporcionan poca información.
2. El paciente se para en medio de una frase o idea y cambia el tema en respuesta a estímulos inmediatos.
3. El paciente responde de forma oblicua, tangencial o incluso relevante.
4. Un patrón de habla espontánea en el que las ideas se escabullen unas de otras.
5. El paciente habla rápidamente y es difícil interrumpirle.

Respuesta correcta: 2. El paciente se para en medio de una frase o idea y cambia el tema en respuesta a estímulos inmediatos.